35 歲的王太太罹患重度憂鬱症，服用百憂解（fluoxetine）後出現：躺不住、坐不住、不斷地走來走去，下列藥物治療何者最有效？
A. 抗乙醯膽鹼藥物（anticholinergic agent）
B. 抗組織胺藥物（antihistamine）
C. 苯二氮平類藥物（benzodiazepine）
D. 乙型腎上腺素受體阻斷劑（β-adrenergic receptor blocker）

正確答案：D. 乙型腎上腺素受體阻斷劑（β-adrenergic receptor blocker）